Clinical trial exclusion criterion:
Has chronic hepatitis B (measured by hepatitis B surface antigen test) or active hepatitis C (measured by hepatitis C virus [HCV] Ab test; if positive, HCV ribonucleic acid [RNA] PCR test will be used to confirm active versus past HCV infection), active syphilis infection, chlamydia, gonorrhea, or trichomonas . Active syphilis documented by serology unless positive serology is due to past treated infection

Entity relations:
- AND("chronic hepatitis B", "hepatitis B surface antigen test")
- AND("positive", "HCV ribonucleic acid [RNA] PCR test")
- Has_value("hepatitis C virus [HCV] Ab test", "positive")
- AND("active hepatitis C", "hepatitis C virus [HCV] Ab test")
- Has_qualifier("syphilis infection", "active")
- Has_qualifier("syphilis", "Active")
- AND("syphilis", "serology")
- Has_value("serology", "positive")
- AND("positive", "treated infection")
- Has_negation("serology", "unless")
- OR("chronic hepatitis B", "active hepatitis C", "syphilis infection", "chlamydia", "gonorrhea", "trichomonas", "syphilis")
- OR("serology", "serology")